What are the effects of 14-3-3 dimers on Tau phosphorylation?

14-3-3 dimers regulate steady-state phosphorylation of both wild-type and the R406W mutant Tau, but they are not essential for toxicity of either variant.